Clinical trial inclusion criterion:
Septic shock patients despite early goal directed therapy

Entity relations:
- AND("Septic shock", "early goal directed therapy")